Clinical trial exclusion criterion:
BMI more than 30

Annotated entities:
- Measurement: "BMI"
- Value: "more than 30"